ALP >= 3 x ULN

The above is a clinical trial exclusion criterion. Annotated with entity spans:
[Measurement: ALP] [Value: >= 3 x ULN]